Clinical trial exclusion criterion:
Presence of serious cardiac or respiratory disease

Annotated entities:
- Condition: "respiratory disease"
- Condition: "cardiac disease"
- Qualifier: "serious"